¿Cuál de los fármacos reseñados podría producir esofagitis si no se administra adecuadamente?:
1. Alendronato.
2. Raloxifeno.
3. Ranelato de estroncio.
4. Teriparatida.

Respuesta correcta: 1. Alendronato.